Clinical trial exclusion criterion:
Subjects with contraindications to participation in an exercise training program

Entity relations:
- Has_context("contraindications", "participation in an exercise training program")